Clinical trial inclusion criterion:
Have chronic kidney disease with GFR <50

Annotated entities:
- Condition: "chronic kidney disease"
- Measurement: "GFR"
- Value: "<50"